Clinical trial exclusion criterion:
Patients not capable or willing to provide informed consent

Annotated entities:
- Non-query-able: "Patients not capable or willing to provide informed consent"